El volumen minuto del ventrículo derecho e izquierdo es:
1. Similar.
2. Mucho mayor en el izquierdo porque la post carga es mayor.
3. Mucho menor en el derecho porque la presión de eyección es menor
4. Mucho menor en el derecho porque la musculatura del ventrículo derecho es menor.

Respuesta correcta: 1. Similar.